3. Pulmonary vascular resistance (PVR) ≥300 dyn•s/cm5 (3.75 Wood units)

The above is a clinical trial inclusion criterion. Annotated with entity spans:
[Parsing_Error: 3.] [Condition: Pulmonary vascular resistance (PVR)] [Value: ≥300 dyn•s/cm5] ([Value: 3.75 Wood units])